Clinical trial inclusion criteria:
Aged between 18-70 years
Meets the Diagnostic and Statistical Manual (DSM) IV and DSM-V diagnostic criteria for generalised anxiety disorder (GAD) based on structured interview (Mini International Neuropsychiatric Interview-Plus 6 [MINI-Plus 6]. Note that while the MINI-Plus 6 uses the DSM-IV criteria, the same criteria are used in the DSM-V).
Presents with anxiety (Hamilton Anxiety Rating Scale = 18) at the time of study entry
Fluent in written and spoken English
Provides a signed copy of the consent form
Primary diagnosis other than GAD
Presentation of moderate to severe depressive symptoms (Montgomery-Asberg Rating Scale: MADRS = 18 at time of study entry or = 24 at any time during study)
Presentation of suicidal ideation (= 3 on MADRS suicidal thoughts domain at time of study entry or at any time during study)
Current diagnosis of bipolar disorder or schizophrenia on structured interview (MINI Plus)
Current substance/alcohol use disorder on structured interview (MINI Plus) Page 21 of 39 Commercial-in-Confidence
Currently taking an antidepressant, mood stabiliser, antipsychotic, anticonvulsant, warfarin or thyroxin, or current regular use (more than 2 days per week) of a benzodiazepine or opioid-based analgesic
Current use of a psychotropic nutraceutical (e.g. St John's wort)
Previous intolerance to kava
Three or more failed trials of pharmacotherapy for the current GAD episode
Recently commenced psychotherapy (within four weeks of study entry)
Known or suspected clinically unstable systemic medical disorder
Diagnosed hepato-biliary disease/inflammation
Elevated liver enzymes at baseline blood test
Pregnancy or breastfeeding, or trying to conceive
Not using medically approved contraception (including abstinence) if female and of childbearing age
Unable to participate in all scheduled visits, treatment plan, or other trial procedures according to the protocol (except for the optional genetic component)

Annotated entities:
- Person: "Aged"
- Value: "between 18-70 years"
- Measurement: "Diagnostic and Statistical Manual (DSM) IV and DSM-V diagnostic criteria"
- Condition: "generalised anxiety disorder"
- Condition: "GAD"
- Procedure: "structured interview"
- Procedure: "Mini International Neuropsychiatric Interview-Plus 6 [MINI-Plus 6]"
- Condition: "anxiety"
- Measurement: "Hamilton Anxiety Rating Scale"
- Value: "= 18"
- Temporal: "at the time of study entry"
- Reference_point: "time of study entry"
- Non-query-able: "Fluent in written and spoken English"
- Non-query-able: "Provides a signed copy of the consent form"
- Condition: "GAD"
- Condition: "Primary diagnosis"
- Negation: "other than"
- Qualifier: "moderate to severe"
- Condition: "depressive symptoms"
- Measurement: "Montgomery-Asberg Rating Scale"
- Measurement: "MADRS"
- Value: "= 18"
- Temporal: "at time of study entry"
- Value: "= 24"
- Temporal: "at any time during study"
- Condition: "suicidal ideation"
- Value: "= 3"
- Measurement: "MADRS suicidal thoughts domain"
- Temporal: "at time of study entry"
- Temporal: "at any time during study"
- Condition: "bipolar disorder"
- Condition: "schizophrenia"
- Measurement: "structured interview"
- Measurement: "MINI Plus"
- Condition: "alcohol use disorder"
- Condition: "substance use disorder"
- Measurement: "structured interview"
- Measurement: "MINI Plus"
- Drug: "antidepressant"
- Condition: "taking"
- Temporal: "Currently"
- Drug: "mood stabiliser"
- Drug: "antipsychotic"
- Drug: "anticonvulsant"
- Drug: "warfarin"
- Drug: "thyroxin"
- Drug: "benzodiazepine"
- Drug: "opioid-based analgesic"
- Multiplier: "more than 2 days per week"
- Multiplier: "regular"
- Temporal: "current"
- Procedure: "use"
- Drug: "psychotropic nutraceutical"
- Condition: "St John's wort"
- Temporal: "Current"
- Procedure: "use"
- Condition: "intolerance"
- Drug: "kava"
- Temporal: "Previous"
- Multiplier: "Three or more"
- Procedure: "trials of pharmacotherapy"
- Qualifier: "failed"
- Condition: "GAD episode"
- Temporal: "current"
- Procedure: "psychotherapy"
- Temporal: "within four weeks of study entry"
- Temporal: "Recently"
- Qualifier: "clinically unstable"
- Qualifier: "systemic"
- Condition: "medical disorder"
- Mood: "suspected"
- Mood: "Known"
- Condition: "hepato-biliary disease"
- Condition: "hepato-biliary inflammation"
- Value: "Elevated"
- Measurement: "liver enzymes"
- Temporal: "baseline"
- Procedure: "blood test"
- Condition: "Pregnancy"
- Observation: "breastfeeding"
- Condition: "trying to conceive"
- Negation: "Not"
- Qualifier: "medically approved"
- Procedure: "contraception"
- Procedure: "abstinence"
- Person: "female"
- Person: "childbearing age"
- Observation: "age"
- Value: "childbearing"
- Observation: "Unable to participate"
- Visit: "scheduled visits"
- Mood: "treatment plan"
- Procedure: "trial procedures"
- Negation: "except for"
- Observation: "genetic component"